Implantation of a cardiac resynchronization therapy (CRT) device within 3 months or intent to implant a CRT.

The above is a clinical trial exclusion criterion. Annotated with entity spans:
[Procedure: Implantation] of a [Device: cardiac resynchronization therapy (CRT) device] [Temporal: within 3 months] or [Mood: intent] to [Procedure: implant] a [Device: CRT].